Clinical trial exclusion criterion:
History of other malignancy within the last 5 years, except for appropriately treated carcinoma in situ of the cervix, non-melanoma skin carcinoma, Stage I uterine cancer, or other cancers with a similar outcome as those previously mentioned.

Annotated entities:
- Temporal: "within the last 5 years"
- Condition: "carcinoma in situ of the cervix"
- Qualifier: "appropriately treated"
- Procedure: "treated"
- Condition: "non-melanoma skin carcinoma"
- Condition: "uterine cancer"
- Measurement: "Stage"
- Value: "I"
- Condition: "malignancy"
- Qualifier: "other"
- Negation: "except for"
- Non-representable: "or other cancers with a similar outcome as those previously mentioned"